Uno de los conceptos principales de la Terapia de Aceptación y Compromiso es:
1. La relativización del contexto.
2. El motivo subyacente.
3. La evitación experiencial.
4. La resistencia al cambio.
5. La vulnerabilidad emocional.

Respuesta correcta: 3. La evitación experiencial.